下列有關老人尿失禁的描述，何者正確？
A. 80歲以上女性最常見的尿失禁種類是「混合型」尿失禁
B. 使用利尿劑類的降血壓藥不會增加尿失禁的機會
C. 使用安眠鎮靜藥不會增加尿失禁的機會
D. 第一線尿失禁的治療是使用藥物治療

正確答案：A. 80歲以上女性最常見的尿失禁種類是「混合型」尿失禁